下列有關脊髓小腦共濟失調症（spinocerebellar ataxia）的敘述，何者正確？
A. 有些是體染色體顯性遺傳、有些是隱性遺傳、有些則是偶發性的
B. 造成脊髓小腦共濟失調症（spinocerebellar ataxia）的基因突變只有三核甘酸重複（trinucleotide repeat）  	延長的型態
C. 三核甘酸重複（trinucleotide repeat）延長的位置只出現在編碼位置（coding region）
D. 巴金森氏症候群主要是因為丘腦的異常而導致，不會有小腦共濟失調的現象

正確答案：A. 有些是體染色體顯性遺傳、有些是隱性遺傳、有些則是偶發性的